Clinical trial exclusion criterion:
Previous intracranial bleeding

Annotated entities:
- Temporal: "Previous"
- Procedure: "intracranial bleeding"